Clinical trial exclusion criterion:
pregnant or breastfeeding patients

Annotated entities:
- Condition: "pregnant"
- Observation: "breastfeeding"